treated with rituximab-based immunochemotherapy

The above is a clinical trial inclusion criterion. Annotated with entity spans:
treated with [Qualifier: rituximab-based] [Procedure: immunochemotherapy]